Subject has history of previous myocardial infarction or percutaneous intervention during the last three months.

The above is a clinical trial exclusion criterion. Annotated with entity spans:
Subject has history of previous [Condition: myocardial infarction] or [Procedure: percutaneous intervention] during the [Temporal: last three months].